Chronic or acute hepatitis B infection

The above is a clinical trial exclusion criterion. Annotated with entity spans:
[Condition: Chronic] or [Condition: acute hepatitis B infection]